Clinical trial inclusion criterion:
Type B natriuretic peptide (BNP) >150 pg/ml (or pro-BNP [N-terminal-proBNP] = 600 pg / ml) or if the patient was hospitalized for cardiac decompensation within the preceding 12 months, BNP >100 pg/ml (or N-terminal-proBNP = 400 pg / ml)

Entity relations:
- Has_value("pro-BNP [N-terminal-proBNP]", "= 600 pg / ml")
- Has_value("Type B natriuretic peptide (BNP)", ">150 pg/ml")
- AND("hospitalized", "cardiac decompensation")
- Has_temporal("hospitalized", "within the preceding 12 months")
- Has_value("BNP", ">100 pg/ml")
- Has_value("N-terminal-proBNP", "= 400 pg / ml")
- AND("hospitalized", "BNP")
- OR("Type B natriuretic peptide (BNP)", "pro-BNP [N-terminal-proBNP]")
- OR("BNP", "N-terminal-proBNP")
- OR("Type B natriuretic peptide (BNP)", "hospitalized")